Clinical trial exclusion criterion:
Patients who do not meet the inclusion criteria and those who have a history of allergic reactions to human albumin, as well as those who have received iodinated contrast during the 7 days prior to surgery and pregnant women, will be excluded from the study.

Annotated entities:
- Negation: "not"
- Observation: "meet the inclusion criteria"
- Temporal: "history"
- Condition: "allergic"
- Drug: "human albumin"
- Drug: "iodinated contrast"
- Temporal: "during the 7 days prior to surgery"
- Reference_point: "surgery"
- Procedure: "surgery"
- Condition: "pregnant"
- Person: "women"